What is the purpose of the Unique Connectivity of Uncharged Compounds (UC2) search tool?

The Unique Connectivity of Uncharged Compounds (UC2) search tool is used for metabolite annotation by database searching in mass spectrometry-based metabolomics.